兩天後，上述病人抱怨兩腿酸痛、腫脹，並且發現茶色尿，但尿量沒有明顯變少。下肢檢查發現肌肉有壓 痛。血中肌酸激酶（creatine kinase）42,700 U/L、肌酸酐（creatinine）2.8 mg/dL、鉀5.0 mmol/L、鈣2.07 mmol/L；尿液潛血反應呈4+，但顯微鏡檢查未看到紅血球。下列處置何者最適當？
A. 維持每小時尿量200～300 mL
B. 酸化尿液
C. 每天補充2,500 mL生理食鹽水
D. 開始透析治療

正確答案：A. 維持每小時尿量200～300 mL